Clinical trial inclusion criterion:
Intradermal reaction to Tuberculin (PPD skin test) or Mycobacterium tuberculosis antigenspecific interferon-gamma release assay (IGRA)

Entity relations:
- OR("Intradermal reaction to Tuberculin (PPD skin test)", "Mycobacterium tuberculosis antigenspecific interferon-gamma release assay (IGRA)")